Clinical trial inclusion criterion:
treatment with dual antiplatelet therapy (clopidogrel and acetylsalicylic acid) between left atrial appendage closure and randomization

Annotated entities:
- Procedure: "dual antiplatelet therapy"
- Drug: "clopidogrel"
- Drug: "acetylsalicylic acid"
- Procedure: "left atrial appendage closure"
- Temporal: "between left atrial appendage closure and randomization"
- Reference_point: "randomization"
- Reference_point: "left atrial appendage closure"